Has at least one HIV-infected sexual partner for =4 weeks.

The above is a clinical trial inclusion criterion. Annotated with entity spans:
Has [Multiplier: at least one] [Condition: HIV-infected] [Observation: sexual partner] for [Value: =4 weeks].